Reduced HDL-cholesterol (<40mg/dl in men, <50 mg/dl in women), or on medication for treating the condition

The above is a clinical trial inclusion criterion. Annotated with entity spans:
[Value: Reduced] [Measurement: HDL-cholesterol] ([Value: <40mg/dl] in [Person: men], [Value: <50 mg/dl] in [Person: women]), or on [Drug: medication for treating] the condition